En el tratamiento cognitivo-conductual del Trastorno Obsesivo Compulsivo, los experimentos conductuales:
1. Sustituyen a la exposición en vivo cuando esta técnica no puede aplicarse.
2. Deben graduarse en cuanto a complejidad, al igual que se hace con la exposición.
3. Sólo deben utilizarse en la fase de prevención de recaídas pues permiten predicciones más precisas.
4. Son útiles para que el paciente pueda comprobar en su vida cotidiana que sus predicciones catastrofistas no se corresponden con la realidad.

Respuesta correcta: 4. Son útiles para que el paciente pueda comprobar en su vida cotidiana que sus predicciones catastrofistas no se corresponden con la realidad.